一位 35 歲女性發現左側腋下有一 3×2 公分固定無痛之淋巴結，無其他位置病灶，下列何種染色無法協助其診斷？
A. Estrogen receptor
B. Thyroid transcription factor 1(TTF-1)
C. Leukocyte common antigen
D. Prostate specific antigen

正確答案：D. Prostate specific antigen